Clinical trial inclusion criterion:
Male and female subjects between 40-85 years old will be enrolled. Younger subjects are not included as the risk for brain amyloid lesions is too low

Entity relations:
- Has_value("old", "between 40-85 years")
- OR("Male", "female")